Clinical trial exclusion criterion:
Portal vein thrombosis

Annotated entities:
- Condition: "Portal vein thrombosis"